Clinical trial inclusion criterion:
Creatinine < 2 × upper normal limits.

Entity relations:
- Has_value("Creatinine", "< 2 × upper normal limits")